American Society of Anesthesiology class I-III

The above is a clinical trial inclusion criterion. Annotated with entity spans:
[Measurement: American Society of Anesthesiology class] [Value: I-III]